Which genes have been proposed as potential candidates for gene therapy of heart failure?

There are at least 6 genes which have been proposed as potential candidates of gene therapy in heart failure.
1. Cardiac Sarco-Endoplasmic Reticulum Calcium ATPase 2A (SERCA2A)
2. Inhibitor 1 (I-1) of Protein Phosphatase 1B
3. Protein Phosphatase 1B (PP1B)
4. Yes Associated Protein (YAP)
5. Survivin
6. S100A1